El efecto estabilizador de los grupos alquilo sobre los enlaces 𝝅 adyacentes se explica en términos de:
1. Isomería.
2. Mesomería.
3. Efecto inductivo.
4. Hiperconjugación.
5. Estereoisomería.

Respuesta correcta: 4. Hiperconjugación.